Los arbovirus se transmiten a través de:
1. Murciélagos.
2. Roedores.
3. Artrópodos.
4. Perros.

Respuesta correcta: 3. Artrópodos.